31歲女性，長期為經痛所苦，疑似子宮內膜異位症（endometriosis），下列何者為確定診斷的方式？
A. 超音波影像
B. 理學檢查（內診）判定
C. 測血中CA-125值高
D. 腹腔鏡下切片

正確答案：D. 腹腔鏡下切片